Clinical trial exclusion criterion:
Acute clinically significant pulmonary, cardiovascular, hepatic or renal functional abnormality, as determined by physical examination or laboratory screening tests.

Entity relations:
- OR("pulmonary functional abnormality", "cardiovascular functional abnormality", "hepatic functional abnormality", "renal functional abnormality")